Describe the mechanism of action of Bezlotoxumab?

Bezlotoxumab (Zinplava™) is a human monoclonal antibody against Clostridium difficile toxin B (TcdB). It is used for prevention of  recurrent C. difficile infections.